chronic diseases e.g. cerebral palsy, metabolic disease, etc.

The above is a clinical trial exclusion criterion. Annotated with entity spans:
[Condition: chronic diseases] e.g. [Condition: cerebral palsy], [Condition: metabolic disease], etc.